Clinical trial exclusion criterion:
Weight > 220 pounds

Annotated entities:
- Measurement: "Weight"
- Value: "> 220 pounds"